Clinical trial inclusion criterion:
Patients diagnosed with primary or secondary fibromyalgia.

Entity relations:
- Has_qualifier("fibromyalgia", "primary")
- OR("primary", "secondary")